Clinical trial exclusion criterion:
Uremia patients or Creatinine = 2 mg/dl.

Entity relations:
- Has_value("Creatinine", "= 2 mg/dl")
- OR("Uremia", "Creatinine")